Capable of giving informed consent and complying with study procedures

The above is a clinical trial inclusion criterion. Annotated with entity spans:
[Non-query-able: Capable of giving informed consent and complying with study procedures]